history or records of immunosuppressive therapy (with the exception of topical corticosteroids) for more than 14 days and within 6 months of vaccination

The above is a clinical trial exclusion criterion. Annotated with entity spans:
history or records of [Procedure: immunosuppressive therapy] (with the [Negation: exception] of [Procedure: topical corticosteroids]) [Temporal: for more than 14 days] and [Temporal: within 6 months of vaccination]